Clinical trial inclusion criterion:
4. de novo native vessels;

Annotated entities:
- Qualifier: "de novo"
- Condition: "native vessels"